Los componentes básicos de un Espectrómetro de Masas son:
1. Sistema de introducción de muestra-fuente de ionización-detector de iones-analizador de masas-procesador de la señal-dispositivo de lectura.
2. Sistema de introducción de muestraanalizador de masas-fuente de ionizacióndetector de iones-dispositivo de lecturaprocesador de la señal.
3. Sistema de introducción de muestra-fuente de ionización-detector de iones-analizador de masas-dispositivo de lectura-procesador de la señal.
4. Sistema de introducción de muestra-fuente de ionización-analizador de masas-detector de iones-procesador de la señal-dispositivo de lectura.

Respuesta correcta: 4. Sistema de introducción de muestra-fuente de ionización-analizador de masas-detector de iones-procesador de la señal-dispositivo de lectura.